Clinical trial exclusion criterion:
Had a serious infection, has been hospitalized for an infection, or has been treated with IV antibiotics for an infection within 2 months prior to Baseline

Annotated entities:
- Condition: "serious infection"
- Procedure: "hospitalized"
- Condition: "infection"
- Drug: "IV antibiotics"
- Condition: "infection"
- Temporal: "within 2 months prior to Baseline"